What imaging modalities have been listed as method of choice  to diagnose CSF leak?

CT cisternography in the investigation of cerebrospinal fluid rhinorrhoea. CTC is an accurate, well-tolerated procedure and should be regarded as the method of choice for investigation of this condition.
...unenhanced (three-dimensional constructive interference in steady state (3D-CISS)...In conclusion, 3D-CISS is a non-invasive and reliable technique, and should be the first-choice method to localise CSF leak.